Clinical trial exclusion criterion:
Mental retardation

Annotated entities:
- Condition: "Mental retardation"